Hepatic impairment (aspartate aminotransferase more than three times normal) or renal function impairment (serum creatinine level >133 µmol/L, Estimated Glomerular Filtration Rate (eGFR) <60)

The above is a clinical trial exclusion criterion. Annotated with entity spans:
[Condition: Hepatic impairment] ([Measurement: aspartate aminotransferase] [Value: more than three times normal]) or [Condition: renal function impairment] ([Measurement: serum creatinine level] [Value: >133 µmol/L], [Measurement: Estimated Glomerular Filtration Rate (eGFR)] [Value: <60])